Clinical trial inclusion criterion:
Suspicion of neurologic dysfunction at tested sites

Annotated entities:
- Mood: "Suspicion"
- Condition: "neurologic dysfunction"
- Qualifier: "tested sites"